治療創傷後壓力症候群（posttraumatic stress disorder）的第一線用藥，下列何者最適合？
A. 苯二氮平類藥物（benzodiazepines, BZDs）
B. 三環類抗鬱劑（tricyclic antidepressants, TCAs）
C. 選擇性血清素再吸收抑制劑（selective serotonin reuptake inhibitors, SSRIs）
D. 單胺氧化酶抑制劑（monoamine oxidase inhibitors, MAOIs）

正確答案：C. 選擇性血清素再吸收抑制劑（selective serotonin reuptake inhibitors, SSRIs）